下列何者與APOE基因的ε4多型性 （Polymorphism）關係最為密切？
A. 巴金森失智症（Parkinson disease dementia）
B. 額顳葉失智症（frontotemporal dementia）
C. 阿茲海默失智症（Alzheimer dementia）
D. 血管性失智症（vascular dementia）

正確答案：C. 阿茲海默失智症（Alzheimer dementia）